Clinical trial exclusion criterion:
No positive HIV 1 or HIV 2 test at screening

Annotated entities:
- Value: "positive"
- Measurement: "HIV 1 test"
- Measurement: "HIV 2 test"
- Temporal: "at screening"
- Reference_point: "screening"